What is the purpose of the Ottawa Ankle Rule?

Ottawa Ankle Rules is a clinical decision tool used to minimize unnecessary radiographs in ankle and foot injuries. It shows the areas of tenderness to be evaluated in ankle trauma patients to determine the need for imaging.